Patients at risk for endovascular infection (previously documented rheumatic heart disease, congenital valve disease, surgically repaired congenital heart disease, unrepaired cyanotic congenital heart disease, any intracardiac repair with prosthetic material [mechanical or bio-prosthetic cardiac valves], previous or current endocarditis, permanent endovascular devices (e.g., endovascular grafts [e.g., aortic aneurysm repair, stents involving large arteries such as aorta, femorals and carotids], inferior vena cava filters, dialysis vascular grafts), tunnelled (not short-term) hemodialysis catheters, pacemakers or defibrillators. Patients with temporary central venous catheters, central venous dialysis catheters or peripherally inserted central catheters (PICCs) are not excluded and patients with coronary artery stents, coronary artery bypass grafts (CABG) or neurovascular coils are not excluded; patients with mitral valve prolapse or bicuspid aortic valve are not excluded providing they have no other exclusion criteria;

The above is a clinical trial exclusion criterion. Annotated with entity spans:
Patients at [Observation: risk for endovascular infection] (previously documented [Condition: rheumatic heart disease], [Condition: congenital valve disease], [Qualifier: surgically repaired] [Condition: congenital heart disease], [Qualifier: unrepaired] [Condition: cyanotic congenital heart disease], any [Procedure: intracardiac repair] with [Device: prosthetic material] [[Device: mechanical] or [Device: bio-prosthetic cardiac valves]], previous or current [Condition: endocarditis], [Qualifier: permanent] [Device: endovascular devices] (e.g., [Device: endovascular grafts] [e.g., [Procedure: aortic aneurysm repair], [Device: stents] involving [Qualifier: large arteries] such as aorta, femorals and carotids], [Device: inferior vena cava filters], [Device: dialysis vascular grafts]), tunnelled (not short-term) [Device: hemodialysis catheters], [Device: pacemakers] or defibrillators. Patients with temporary [Device: central venous catheters], [Device: central venous dialysis catheters] or [Device: peripherally inserted central catheters] ([Device: PICCs]) are [Negation: not] excluded and patients with [Device: coronary artery stents], [Device: coronary artery bypass grafts] (CABG) or [Device: neurovascular coils] are [Negation: not] excluded; patients with [Condition: mitral valve prolapse] or [Condition: bicuspid aortic valve] are [Negation: not] excluded providing they have no other exclusion criteria;